Clinical trial exclusion criterion:
heavy calcification.

Entity relations:
- Has_qualifier("calcification", "heavy")